根據「擁有心理健康是權利、維護心理健康是責任」的意涵，下列何者錯誤？
A. 罹患精神疾病是無法抗拒的
B. 沒有心理健康就不能稱之為健康
C. 我們需要有國家的心理健康政策
D. 社會、政治、經濟、醫療等因素都會影響心理健康

正確答案：A. 罹患精神疾病是無法抗拒的